有關萊氏細胞（Leydig cell），下列敘述何項錯誤？
A. 位於細精管（seminiferous tubule）間的間質（interstitial tissue）
B. 具有大量的粗糙性內質網（RER）
C. 細胞質含有 Reinke 氏結晶體
D. 細胞質含有管狀的粒線體（tubular cristae mitochondria）

正確答案：B. 具有大量的粗糙性內質網（RER）